Clinical trial exclusion criterion:
Contra-indication to Brimonidine including patients on monoamine oxidase inhibitors (MOA)

Entity relations:
- Subsumes("monoamine oxidase inhibitors", "MOA")
- AND("Contra-indication", "Brimonidine")
- Subsumes("Contra-indication", "monoamine oxidase inhibitors")